Clinical trial inclusion criterion:
Westley croup score between 3 and 11

Entity relations:
- Has_value("Westley croup score", "between 3 and 11")